Which cancer can be treated with Darolutamide?

Darolutamide is used for treatment of nonmetastatic castration-resistant prostate cancer.